Clinical trial exclusion criterion:
Drug/food allergy: Subjects with a history of hypersensitivity to any of the study medications (e.g. beta-agonists, corticosteroid) or components of the inhalation powder (e.g. lactose, magnesium stearate). In addition, patients with a history of severe milk protein allergy that, in the opinion of the study physician, contraindicates the subject's participation will also be excluded.

Annotated entities:
- Condition: "Drug allergy"
- Condition: "food allergy"
- Condition: "hypersensitivity"
- Drug: "beta-agonists"
- Drug: "corticosteroid"
- Drug: "study medications"
- Undefined_semantics: "study medications"
- Drug: "components of the inhalation powder"
- Drug: "lactose"
- Drug: "magnesium stearate"
- Condition: "milk protein allergy"
- Qualifier: "severe"
- Temporal: "history"
- Subjective_judgement: "in the opinion of the study physician, contraindicates the subject's participation will also be excluded"